基於疾病與傷害本身的特異性以及民眾對醫療保健服務需求的特殊性，使得醫療服務市場有一些不同於一般市場。下列何項不屬於醫療保健服務市場之特性？
A. 需求與結果的不確定性
B. 資訊不對等
C. 消費者對醫療服務提供者提供之診治項目的種類、數量、價格有主導權
D. 醫療提供者不一定會追求利潤極大，而可能以病人的需要為最重要的考量

正確答案：C. 消費者對醫療服務提供者提供之診治項目的種類、數量、價格有主導權